一個新生兒有下列何種疾病時，一定要避免卡介苗的施打？
A. 免疫球蛋白低下症
B. 嚴重混合性免疫功能缺損
C. 肺結核家族史
D. 巨細胞病毒胎內感染

正確答案：B. 嚴重混合性免疫功能缺損